Have stable COPD medication within 4 weeks prior to Visit 1 (no new medication added and no dosage changes in medication).

The above is a clinical trial inclusion criterion. Annotated with entity spans:
Have [Qualifier: stable] [Drug: COPD medication] [Temporal: within 4 weeks prior to Visit 1] (no new medication added and no dosage changes in medication).